Fructose intolerance

The above is a clinical trial exclusion criterion. Annotated with entity spans:
[Condition: Fructose intolerance]